Patient is 20 to 70 years of age

The above is a clinical trial inclusion criterion. Annotated with entity spans:
Patient is [Value: 20 to 70 years] of [Person: age]